The Shingrix vaccine is used to prevent what disease?

Shingrix is a 4-component vaccine against capsular herpes zoster (4CZV), which has recently been licensed in Europe, Canada and Australia.